Clinical trial exclusion criterion:
Estimated fetal weight greater than 4500 grams in diabetic and 5000 grams in non-diabetic mother

Entity relations:
- Has_negation("diabetic", "non-")
- Has_value("diabetic", "greater than 4500 grams")
- Has_value("diabetic", "5000 grams")
- AND("Estimated fetal weight", "diabetic")